Clinical trial exclusion criterion:
Current use of serotonin-precursors (such as L-tryptophan, oxitriptan)

Annotated entities:
- Drug: "serotonin-precursors"
- Drug: "L-tryptophan"
- Drug: "oxitriptan"